Clinical trial inclusion criterion:
Kidney transplant recipients

Annotated entities:
- Procedure: "Kidney transplant"